Clinical trial exclusion criterion:
Subject with TBS in an actively infected field (Class III Contaminated or Class IV Dirty or Infected)

Entity relations:
- Has_qualifier("TBS", "Class III Contaminated")
- OR("Class III Contaminated", "Class IV Dirty or Infected")